History of alcohol or drug dependence in the past year

The above is a clinical trial exclusion criterion. Annotated with entity spans:
History of [Condition: alcohol] or [Condition: drug dependence] in [Temporal: the past year]